狗在非麻醉的情況下，若將血液由靜脈迅速抽離而造成失血（bleeding）時，則其心跳增加的主要原因為何？
A. Bainbridge 反射作用高於感壓反射作用
B. 感壓反射作用高於 Bainbridge 反射作用
C. 中樞化學反射作用高於周邊化學反射作用
D. 周邊化學反射作用高於中樞化學反射作用

正確答案：B. 感壓反射作用高於 Bainbridge 反射作用